Zenker diverticulum of esophagus 常發生於：
A. GE junction
B. Middle esophagus
C. Killian's triangle of cricopharyngeus
D. Thoracic inlet

正確答案：C. Killian's triangle of cricopharyngeus